Clinical trial inclusion criterion:
The patients underwent chemotherapy, radiation therapy or targeted therapy(herceptin) after surgery according to the 2013 NCCN guideline.

Annotated entities:
- Procedure: "chemotherapy"
- Procedure: "radiation therapy"
- Procedure: "targeted therapy"
- Drug: "herceptin"
- Reference_point: "surgery"
- Temporal: "after surgery"
- Procedure: "surgery"
- Qualifier: "2013 NCCN guideline"